Clinical trial inclusion criterion:
Age range: 18-45 years

Entity relations:
- Has_value("Age", "18-45 years")